一位一歲兩個月大之幼兒，因被懷疑有發展遲緩而被帶來求診。理學檢查時如果下列那一項反射還存在，則仍可視為是正常的反射？
A. 驚嚇反射（Moro reflex）
B. 蘭多反射（Landau reflex）
C. 張頸力反射（tonic neck reflex）
D. 手掌抓握反應（palmar grasp）

正確答案：B. 蘭多反射（Landau reflex）